The patients signed the written informed consent

The above is a clinical trial inclusion criterion. Annotated with entity spans:
[Non-query-able: The patients signed the written informed consent]